La acetilación de las historias afecta a la transcripción:
1. Bloqueando la incorporación de otros componentes de la maquinaria de transcripción.
2. Impidiendo la remodelación de la cromatina.
3. Facilitando la acción de las helicasas.
4. Disminuyendo la sensibilidad de los receptores nucleares.
5. Reduciendo la afinidad de las histonas por el DNA.

Respuesta correcta: 5. Reduciendo la afinidad de las histonas por el DNA.